Clinical trial inclusion criterion:
HBsAg negative, HBcAb negative, HBsAb positive patients are eligible.

Annotated entities:
- Measurement: "HBsAg"
- Value: "negative"
- Measurement: "HBcAb"
- Value: "negative"
- Measurement: "HBsAb"
- Value: "positive"